• Bacille Calmette-Guerin (BCG) vaccination (12 months off drug)

The above is a clinical trial exclusion criterion. Annotated with entity spans:
• [Drug: Bacille Calmette-Guerin (BCG) vaccination] ([Temporal: 12 months off drug])